La dermatitis por contacto (por ejemplo al níquel) es debida a:
1. Una hipersensibilidad de tipo I.
2. Una hipersensibilidad de tipo II.
3. Una hipersensibilidad de tipo III.
4. Una hipersensibilidad de tipo IV.

Respuesta correcta: 4. Una hipersensibilidad de tipo IV.